Clinical trial exclusion criterion:
Patients with diabetes, Ischemic heart disease (IHD), stroke, malignancy and psychiatric diseases are excluded from study.

Entity relations:
- OR("diabetes", "malignancy", "stroke", "Ischemic heart disease (IHD)", "psychiatric diseases")